Clinical trial exclusion criterion:
Alpha fetoprotein > 50 ng/ml

Entity relations:
- Has_value("Alpha fetoprotein", "> 50 ng/ml")